在診斷人類脊椎神經根病變（radiculopathy）的發生部位上，下列何種電學診斷方法最有臨床診斷價值？
A. 神經傳導（nerve conduction）檢查
B. 肌電圖（electromyography）檢查
C. F波檢查
D. Hoffmann反射檢查

正確答案：B. 肌電圖（electromyography）檢查